Un hombre de 43 años consulta por síndrome diarreico, y refiere entre sus antecedentes 3 neumonías en la edad adulta. Cual de las siguientes estudios inmunológicos debemos solicitar?:
1. Recuento de inmunoglobulinas séricas y test de capacidad de producción de anticuerpos.
2. Test de fagocitosis y metabolismo oxidativo de los neutrófilos.
3. Test     de    apoptosis  (muerte     celular programada) en los linfocitos circulantes del paciente.
4. Estudio del repertorio y clonalidad de los linfocitos T (alfa/beta).
5. En este paciente no procedería solicitar estudio inmunológico alguno.

Respuesta correcta: 1. Recuento de inmunoglobulinas séricas y test de capacidad de producción de anticuerpos.